¿Cuál de los siguientes medicamentos es un anticuerpo monoclonal anti CD20 empleado en el tratamiento de la artritis reumatoide?
1. Alentuzumab.
2. Muromunab.
3. Abalizumab.
4. Rituximab.
5. Visilizumab.

Respuesta correcta: 4. Rituximab.